Chronic medical disease

The above is a clinical trial exclusion criterion. Annotated with entity spans:
[Condition: Chronic medical disease]